Clinical trial exclusion criterion:
History of epilepsy or convulsions due to any reason.

Annotated entities:
- Condition: "epilepsy"
- Condition: "convulsions"